Clinical trial inclusion criterion:
PaCO2 < 50mm Hg

Entity relations:
- Has_value("PaCO2", "< 50mm Hg")